Clinical trial exclusion criterion:
History of seizure disorder

Annotated entities:
- Condition: "seizure disorder"
- Temporal: "History"